Clinical trial inclusion criterion:
eligible based on WALI screening tool

Annotated entities:
- Procedure: "WALI screening tool"
- Value: "eligible"